下列何者的破裂最可能造成蛛網膜下腔出血？
A. 中腦膜動脈（middle meningeal artery）
B. 大腦動脈（cerebral artery）
C. 大腦靜脈（cerebral vein）
D. 硬腦膜靜脈竇（dural sinus）

正確答案：B. 大腦動脈（cerebral artery）